Complex kidney stone (staghorn calculi GUYS III and IV)

The above is a clinical trial inclusion criterion. Annotated with entity spans:
[Condition: Complex kidney stone] ([Condition: staghorn calculi] [Measurement: GUYS] [Value: III and IV])